下列何者為最有效治療多重抗藥菌株 M. tuberculosis 對 streptomycin 有抗藥性的首選藥物？
A. Amikacin
B. Spectinomycin
C. Gentamicin
D. Clarithromycin

正確答案：A. Amikacin